Platelet count ≥100 x 109 /L.

The above is a clinical trial inclusion criterion. Annotated with entity spans:
[Measurement: Platelet count] [Value: ≥100 x 109 /L].